What biologic process in the body is associated with Mast cells?

Mast cells are significantly involved in IgE-mediated allergic reactions but may be involved in defense against parasites as well as other immune mediated diseases including heart disease